Clinical trial exclusion criterion:
10. Current smoker.

Annotated entities:
- Temporal: "Current"
- Observation: "smoker"